Clinical trial exclusion criterion:
Neurogenic bladder

Annotated entities:
- Condition: "Neurogenic bladder"